Clinical trial exclusion criterion:
Chronic infectious disease, system or organ disorder or other medical condition that would place patient at undue risk by study participation

Annotated entities:
- Subjective_judgement: "Chronic infectious disease, system or organ disorder or other medical condition that would place patient at undue risk by study participation"